下列何種腹瀉（Diarrhea）的機制是屬於Secretory type diarrhea？
A. 先天性氯化物性腹瀉（Congenital chloride diarrhea）
B. 乳糖耐受不良腹瀉（Lactase deficiency）
C. 腸躁症（Irritable bowel syndrome）
D. 乳糜瀉（Celiac disease）

正確答案：A. 先天性氯化物性腹瀉（Congenital chloride diarrhea）